Clinical trial exclusion criterion:
Osteoporosis or major risk for bone fractures.

Entity relations:
- Has_mood("bone fractures", "major risk")
- OR("Osteoporosis", "bone fractures")